下列何者可增加吸入性麻醉劑之最低肺泡濃度（minimum alveolar concentration）值？
A. 年紀大於七十歲
B. 嚴重低血壓
C. 懷孕
D. 甲狀腺亢進

正確答案：D. 甲狀腺亢進